下列那一選項非為我國優生保健法對人工流產的相關規定？
A. 人工流產實施期間為認定胎兒在母體外不能自然保持其生命之期間
B. 人工流產應在 20 週內實施
C. 婦女因先生患有有礙優生之遺傳性疾病要求人工流產時，無須取得配偶的同意
D. 婦女沿用「因懷孕或生產，將影響其心理健康或家庭生活者」此條款規定要求人工流產時應取得配偶的同意

正確答案：B. 人工流產應在 20 週內實施